Clinical trial exclusion criterion:
Established diagnosis of diabetes mellitus

Annotated entities:
- Condition: "diabetes mellitus"